La heterocromatina carece de:
1. Histona H1.
2. Nucleosomas.
3. Exones.
4. Actividad transcripcional.
5. Orígenes de replicación.

Respuesta correcta: 4. Actividad transcripcional.